Severe renal dysfunction (eGFR=30 ml/min/1.73m2).

The above is a clinical trial exclusion criterion. Annotated with entity spans:
[Qualifier: Severe] [Condition: renal dysfunction] ([Measurement: eGFR][Value: =30 ml/min/1.73m2]).